Clinical trial exclusion criteria:
Smokers
Patients under chronic use of medications
Neurological diseases
Coronary artery disease
Acute heart failure
Chronic renal failure (GFR < 30 ml/min)
Chronic obstructive pulmonary disease
Mild OSA and patients with BMI over 40 kg/m2.

Annotated entities:
- Condition: "Smokers"
- Multiplier: "chronic use"
- Drug: "medications"
- Condition: "Neurological diseases"
- Condition: "Coronary artery disease"
- Condition: "Acute heart failure"
- Condition: "renal failure"
- Multiplier: "Chronic"
- Measurement: "GFR"
- Value: "< 30 ml/min"
- Condition: "obstructive pulmonary disease"
- Multiplier: "Chronic"
- Condition: "Mild OSA"
- Measurement: "BMI"
- Value: "over 40 kg/m2"